肌肉組織是對缺血（ischemia）最敏感的組織之一，則約在缺血多少小時後，肌肉組織將發生不可逆（irreversible）的變化 ？
A. 2小時
B. 4小時
C. 6小時
D. 8小時

正確答案：D. 8小時